Clinical trial inclusion criterion:
1. Mean pulmonary arterial pressure ≥25 mmHg (at rest) and

Entity relations:
- Has_value("Mean pulmonary arterial pressure", "≥25 mmHg")
- Has_qualifier("Mean pulmonary arterial pressure", "at rest")